Clinical trial exclusion criterion:
Subject refusing to sign the consent form

Annotated entities:
- Post-eligibility: "Subject refusing to sign the consent form"
- Non-query-able: "Subject refusing to sign the consent form"